Clinical trial inclusion criterion:
4. Enrolled within 18 hours of commencing antimalarial treatment

Entity relations:
- Has_index("within 18 hours", "commencing antimalarial treatment")